serotonin norepinephrine reuptake inhibitors

The above is a clinical trial exclusion criterion. Annotated with entity spans:
[Drug: serotonin norepinephrine reuptake inhibitors]